Clinical trial exclusion criterion:
are breastfeeding

Annotated entities:
- Pregnancy_considerations: "are breastfeeding"